當經過亨氏管上行粗枝與遠端小管的流速增加時，同一腎元的腎小球過濾率會降低。反之，流速降低引起腎小球過濾率上升。上述的腎臟生理現象稱為：
A. 腎小管-腎小球回饋（tubuloglomerular feedback）
B. 腎小球-腎小管平衡（glomerulotubular balance）
C. 逆流交換（countercurrent exchange）
D. 逆流倍增（countercurrent multiplier）

正確答案：A. 腎小管-腎小球回饋（tubuloglomerular feedback）